外傷病人有下列何種情況時不做腹部電腦斷層攝影檢查（abdominal computed tomography）？
A. 腹部鈍挫傷（abdominal blunt trauma）
B. 評估是否有胰臟受傷
C. 身體評估無法判斷腹部是否受傷
D. 病人血壓為65〜72 mmHg，脈搏為108〜112 /分鐘，呼吸20〜25 /分鐘

正確答案：D. 病人血壓為65〜72 mmHg，脈搏為108〜112 /分鐘，呼吸20〜25 /分鐘